Clinical trial inclusion criterion:
1. Had a diagnosis of PHN, DN, CRPS, carpal tunnel syndrome, HIV neuropathy, idiopathic sensory neuropathy, or other peripheral neuropathy (upon mutual agreement of the sponsor and investigator)

Annotated entities:
- Condition: "PHN"
- Condition: "DN"
- Condition: "CRPS"
- Condition: "carpal tunnel syndrome"
- Condition: "HIV neuropathy"
- Condition: "neuropathy"
- Condition: "HIV"
- Condition: "sensory neuropathy"
- Qualifier: "idiopathic"
- Condition: "peripheral neuropathy"
- Subjective_judgement: "upon mutual agreement of the sponsor and investigator"